Clinical trial inclusion criterion:
selective operation of inguinal hernia repair<U+3001>orthopedics operation or general surgery operation in children

Entity relations:
- OR("inguinal hernia repair", "orthopedics operation", "general surgery operation")